Current or past diagnoses of other Axis I psychiatric disorders, except for generalized anxiety disorder (GAD) symptoms occurring during a depressive episode

The above is a clinical trial exclusion criterion. Annotated with entity spans:
Current or past diagnoses of [Qualifier: other] [Condition: Axis I psychiatric disorders], [Negation: except for] [Condition: generalized anxiety disorder (GAD)] symptoms occurring [Temporal: during a depressive episode]